Clinical trial exclusion criterion:
Subject is currently involved in another investigational study.

Annotated entities:
- Competing_trial: "Subject is currently involved in another investigational study."
- Competing_trial: "Subject is currently involved in another investigational study."